Clinical trial exclusion criterion:
Healthy Volunteers

Annotated entities:
- Parsing_Error: "Healthy Volunteers"